Clinical trial exclusion criterion:
Known or suspected serious spinal pathology and spinal implants

Entity relations:
- Has_qualifier("spinal pathology", "serious")
- Has_mood("spinal pathology", "Known or suspected")
- OR("Known", "suspected")
- OR("spinal pathology", "spinal implants")